Serum phosphate <3.0 mg/dL

The above is a clinical trial exclusion criterion. Annotated with entity spans:
[Measurement: Serum phosphate] [Value: <3.0 mg/dL]